關於國際衛生健康的現況，下列敘述何者錯誤？
A. 世界衛生組織（World Health Organization，簡稱 WHO）是聯合國所屬機構，而世界衛生大會
B. 全球化有利於醫療衛生相關知識與技術的轉移
C. 全球化有利於各國對於傳染性疾病之散播的防治
D. 國際衛生健康的骨架已變多元，除 WHO 外，並有像世界經濟論壇（World Economic Forum）、世界銀行（World Bank）等非政府組織，也積極從事國際衛生健康事務

正確答案：C. 全球化有利於各國對於傳染性疾病之散播的防治